If the subject is assured of an abstinence throughout the trial period.(e.g. clergy)

The above is a clinical trial exclusion criterion. Annotated with entity spans:
[Pregnancy_considerations: If the subject is assured of an abstinence throughout the trial period.(e.g. clergy)]